Clinical trial exclusion criterion:
more than mild or unstable cardiovascular disease

Annotated entities:
- Condition: "cardiovascular disease"
- Qualifier: "unstable"
- Qualifier: "more than mild"